Clinical trial inclusion criteria:
Motor complete tetraplegia for at least 3 months
Age from 18 to 74 years
Body mass index (BMI) from 18 to 35kg/m2
Informed consent as documented by signature

Annotated entities:
- Condition: "tetraplegia"
- Qualifier: "complete"
- Temporal: "at least 3 months"
- Person: "Age"
- Value: "from 18 to 74 years"
- Measurement: "Body mass index"
- Measurement: "BMI"
- Value: "from 18 to 35kg/m2"
- Informed_consent: "nformed consent as documented by signature"